Abnormal thyroid stimulating hormone (TSH) or thyroxine (T4) levels on screening.

The above is a clinical trial exclusion criterion. Annotated with entity spans:
[Value: Abnormal] [Measurement: thyroid stimulating hormone (TSH)] or [Measurement: thyroxine (T4)] levels [Temporal: on screening].